Clinical trial inclusion criterion:
Lumpy or hard stools in =25% of defecations

Entity relations:
- Has_multiplier("defecations", "=25%")
- AND("Lumpy stools", "defecations")
- OR("Lumpy stools", "hard stools")